E.coli isolate resistant to pivmecillinam

The above is a clinical trial exclusion criterion. Annotated with entity spans:
[Condition: E.coli isolate] [Qualifier: resistant to pivmecillinam]